Unable or unwilling to comply with protocol requirements

The above is a clinical trial exclusion criterion. Annotated with entity spans:
[Post-eligibility: Unable or unwilling to comply with protocol requirements]